Which X chromosome abnormalities present lupus-like symptoms?

Lupus-like symptoms are present due to X-chromosomal abnormalities such as X-linked leiomyosarcoma, polycystic kidney disease, myelodysplastic syndrome (MDS), and X- linked hypogonadotropic hypomyelitis.